志玲每次戴了含鎳的項鍊表演後幾天，就會在接觸的地方產生癢疹。皮膚科醫師認為是免疫反應產生的過敏性皮膚炎。志玲翻查教科書後發現鎳原子太小，應該不會被抗體或 T 細胞接受體辨識。志玲產生癢疹的合理解釋應該為何？
A. 鎳可以刺激 Toll-like 接受體的訊息傳遞
B. 鎳本身可以刺激 T 細胞有絲分裂
C. 鎳本身可以刺激樹突細胞，所以是好的佐劑（adjuvant）
D. 鎳和承載體（carrier）蛋白質結合變成完整的抗原

正確答案：D. 鎳和承載體（carrier）蛋白質結合變成完整的抗原